Severe erosive esophagitis, severe esophageal stricture, active gastric or duodenal ulcer

The above is a clinical trial exclusion criterion. Annotated with entity spans:
[Qualifier: Severe] [Condition: erosive esophagitis], [Qualifier: severe] [Condition: esophageal stricture], [Qualifier: active] [Condition: gastric] or [Condition: duodenal ulcer]